En un semiconductor se cumple que:
1. La banda de valencia tiene mayor energía que la de conducción.
2. La banda de conducción tiene mayor energía que la de valencia.
3. Ambas bandas tienen la misma energía.
4. El que las energías sean iguales o distintas depende del semiconductor específico de que se trate.

Respuesta correcta: 2. La banda de conducción tiene mayor energía que la de valencia.